Los glucocorticoides:
1. Aumentan los niveles de ACTH.
2. Estimulan la secreción de CRH.
3. Son antiinflamatorios.
4. Son hipoglucemiantes.
5. Aumentan las respuestas inmunitarias.

Respuesta correcta: 3. Son antiinflamatorios.